Clinical trial exclusion criterion:
Heart disease, kidney disease or diabetes

Entity relations:
- OR("Heart disease", "kidney disease", "diabetes")